8. Able and willing to give valid written informed consent.

The above is a clinical trial inclusion criterion. Annotated with entity spans:
[Parsing_Error: 8.] [Non-query-able: Able and willing to give valid written informed consent.]